Known heart failure

The above is a clinical trial exclusion criterion. Annotated with entity spans:
Known [Condition: heart failure]